Clinical trial exclusion criterion:
Subject are pregnant

Annotated entities:
- Condition: "pregnant"